Clinical trial inclusion criterion:
Treating surgeon has recommended surgical repair of the aneurysm

Annotated entities:
- Procedure: "surgical repair"
- Condition: "aneurysm"
- Mood: "recommended"
- Qualifier: "Treating surgeon"